Clinical trial exclusion criteria:
AJCC Stage III or greater
Undifferentiated, Anaplastic or Medullary Thyroid Cancer
Planned postoperative TSH goal other than 0.1-0.5 mU/L
History of gastrointestinal malabsorption or gastric bypass surgery
Pregnancy
Use of medications that alter the absorption or metabolism of levothyroxine
Prior use of levothyroxine

Annotated entities:
- Measurement: "AJCC"
- Value: "Stage III or greater"
- Condition: "Medullary Thyroid Cancer"
- Condition: "Anaplastic Thyroid Cancer"
- Condition: "Undifferentiated Thyroid Cancer"
- Measurement: "TSH"
- Qualifier: "postoperative"
- Value: "0.1-0.5 mU/L"
- Negation: "other than"
- Condition: "gastrointestinal malabsorption"
- Procedure: "gastric bypass surgery"
- Pregnancy_considerations: "Pregnancy"
- Drug: "medications"
- Observation: "metabolism of levothyroxine"
- Drug: "levothyroxine"
- Observation: "absorption of levothyroxine"
- Negation: "alter"
- Drug: "levothyroxine"
- Temporal: "Prior"